Greater than or equal to 3 months of pain after onset of symptoms that has failed conservative treatments

The above is a clinical trial inclusion criterion. Annotated with entity spans:
[Temporal: Greater than or equal to 3 months] of [Condition: pain] [Temporal: after onset of symptoms] that has [Mood: failed] [Procedure: conservative treatments]